Clinical trial inclusion criterion:
MADRS score > 20

Annotated entities:
- Measurement: "MADRS score"
- Value: "> 20"